La asociación de edad avanzada, diabetes, otalgia que no evoluciona favorablemente a pesar del tratamiento y parálisis del VII par craneal llevan a pensar en uno de los siguientes cuadros clínicos como primera opción:
1. Carcinoma de nasofaringe.
2. Miringitis granulosa.
3. Laberintitis difusa.
4. Carcinoma del hueso temporal.
5. Otitis externa maligna.

Respuesta correcta: 5. Otitis externa maligna.